Clinical trial exclusion criterion:
Woman who are breastfeeding, pregnant or planning to become pregnant during the course of the study

Annotated entities:
- Person: "Woman"
- Observation: "breastfeeding"
- Condition: "pregnant"
- Mood: "planning to become"
- Condition: "pregnant"
- Temporal: "during the course of the study"